En una reacción de acilación de Friedel-Crafts el electrófilo es un:
1. Catión acilo.
2. Radical acilo.
3. Anión acilo.
4. Radical bencílico.

Respuesta correcta: 1. Catión acilo.